Clinical trial exclusion criterion:
Medical conditions associated with female sexual dysfunction; cardiovascular disease, uncontrolled chronic HT (hypertension) ,DM (diabetes mellitus), History of gynecologic surgery, female gynecological cancer ( breast, ovarian, uterine, cervical)

Annotated entities:
- Condition: "female sexual dysfunction"
- Condition: "Medical conditions"
- Qualifier: "associated with female sexual dysfunction"
- Condition: "cardiovascular disease"
- Qualifier: "uncontrolled"
- Qualifier: "chronic"
- Condition: "HT"
- Condition: "hypertension"
- Condition: "DM"
- Condition: "diabetes mellitus"
- Procedure: "gynecologic surgery"
- Condition: "female gynecological cancer"
- Condition: "breast"
- Condition: "ovarian"
- Condition: "uterine"
- Condition: "cervical"
- Temporal: "History"